Clinical trial exclusion criterion:
Preexisting untreated medical condition (thyroid disease, diabetes mellitus, hypertension, pulmonary conditions, cardiac condition…)

Annotated entities:
- Condition: "medical condition"
- Qualifier: "untreated"
- Condition: "thyroid disease"
- Condition: "diabetes mellitus"
- Condition: "hypertension"
- Condition: "pulmonary conditions"
- Condition: "cardiac condition"
- Qualifier: "Preexisting"